fasting plasma glucose (FPG) =126 mg/dL (7.0 mmol/L)

The above is a clinical trial inclusion criterion. Annotated with entity spans:
[Measurement: fasting plasma glucose (FPG)] [Value: =126 mg/dL] ([Value: 7.0 mmol/L])